Clinical trial exclusion criterion:
Test positive at screening for human immunodeficiency virus (HIV), hepatitis B surface antigen (HbsAg), or hepatitis C virus (HCV)

Annotated entities:
- Value: "positive"
- Temporal: "at screening"
- Measurement: "human immunodeficiency virus (HIV)"
- Measurement: "hepatitis C virus (HCV)"
- Measurement: "hepatitis B surface antigen (HbsAg)"